Clinical trial inclusion criterion:
Level of SCI C3-T1, AIS A & B;

Entity relations:
- Has_value("Level of SCI", "C3-T1")
- Has_value("AIS", "A & B")